Clinical trial exclusion criterion:
Sleep apnea or morbid obesity with possible sleep apnea

Entity relations:
- Has_mood("sleep apnea", "possible")
- AND("morbid obesity", "sleep apnea")
- OR("Sleep apnea", "morbid obesity")